¿A partir de que aminoácido se sintetizan las melaninas?:
1. Triptófano.
2. Tirosina.
3. Serina.
4. Histidina.

Respuesta correcta: 2. Tirosina.